下列有關水痘帶狀疱疹病毒（VZV）的敘述，何者錯誤？
A. 屬於痘病毒科
B. 再發會引起帶狀疱疹
C. 在兒童引起全身性皮膚水泡
D. 屬 DNA 病毒

正確答案：A. 屬於痘病毒科